Clinical trial inclusion criterion:
angiographic stenosis>50% or occlusion of at least one tibial vessel of at least 40mm for which an interventional treatment is scheduled

Annotated entities:
- Measurement: "angiographic stenosis"
- Value: ">50%"
- Condition: "occlusion"
- Multiplier: "at least one"
- Qualifier: "tibial vessel"
- Qualifier: "at least 40mm"
- Procedure: "interventional treatment"
- Mood: "scheduled"